市面上之威而鋼（sildenafil）治療陽痿的主要作用機轉為何？
A. 增加 NO 的合成
B. 增加 NO 的釋出
C. 活化 guanylate cyclase
D. 抑制 phosphodiesterase V

正確答案：D. 抑制 phosphodiesterase V